Clinical trial inclusion criterion:
Platelet count <80,000 or >700,000 cells/mm3, or white blood cell count <3,000 cells/mm3 if persistent (at least 2 abnormal values) within 7 days prior to index procedure.

Entity relations:
- Has_value("white blood cell count", "<3,000 cells/mm3")
- Has_value("Platelet count", "<80,000 or >700,000 cells/mm3")
- Has_index("within 7 days prior to index procedure", "index procedure")
- Has_temporal("Platelet count", "within 7 days prior to index procedure")
- OR("Platelet count", "white blood cell count")